Clinical trial inclusion criterion:
At least one sign of RV pressure overload/dysfunction on CT angiography or echocardiography

Annotated entities:
- Multiplier: "At least one"
- Condition: "sign of RV pressure overload"
- Condition: "sign of RV pressure dysfunction"
- Procedure: "CT angiography"
- Procedure: "echocardiography"